Se utiliza la Naloxona en el tratamiento de la intoxicación con:
1. Benzodiacepinas.
2. Antidepresivos tricíclicos.
3. Opiáceos.
4. Digitálicos.

Respuesta correcta: 3. Opiáceos.